關於肋膜腔積液（pleural effusion）的敘述，下列何者正確？
A. 正常人有肋膜液體（pleural fluid）做為潤滑作用，主要是由visceral pleura產生，然後由parietal pleura吸收
B. 根據Light's criteria，鑑別肋膜腔積液（pleural effusion）是transudate或exudate，須檢測肋膜液體
C. 肋膜腔積液中adenosine deaminase（ADA）level＞50 mg/L，須高度懷疑為淋巴瘤（lymphoma）
D. 結核（tuberculosis）造成的肋膜腔積液，大多可以培養出結核菌（Mycobacterium tuberculosis）

正確答案：B. 根據Light's criteria，鑑別肋膜腔積液（pleural effusion）是transudate或exudate，須檢測肋膜液體